Pulmonary abnormalities or breast x-ray abnormalities;

The above is a clinical trial exclusion criterion. Annotated with entity spans:
[Condition: Pulmonary abnormalities] or [Procedure: breast x-ray] [Value: abnormalities];